Clinical trial exclusion criterion:
Hemodynamic instability

Annotated entities:
- Condition: "Hemodynamic instability"